Clinical trial exclusion criterion:
Patients who are being prepared for surgery, or during or after surgery.

Annotated entities:
- Procedure: "surgery"
- Mood: "being prepared for"
- Temporal: "during surgery"
- Temporal: "after surgery"